Diagnosis of diabetes according ADA criteria:

The above is a clinical trial inclusion criterion. Annotated with entity spans:
Diagnosis of [Condition: diabetes] according [Qualifier: ADA criteria]: